Clinical trial inclusion criterion:
Signed informed consent to participate in the study.

Annotated entities:
- Post-eligibility: "Signed informed consent to participate in the study."
- Non-query-able: "Signed informed consent to participate in the study."